Al comparar las características de los estudios clínicos pragmáticos o confirmatorios respecto de los estudios clínicos explicativos o exploratorios, ¿cuál de las siguientes es una ventaja de los primeros?
1. Información sobre subgrupos de pacientes representativos de la práctica clínica habitual.
2. Muestra muy homogénea, con escasa variabilidad.
3. Mayor capacidad para detectar diferencias en la eficacia de las intervenciones.
4. Mayor validez interna.
5. Menor tamaño muestral.

Respuesta correcta: 1. Información sobre subgrupos de pacientes representativos de la práctica clínica habitual.